Have other medical implants that may interact with MRI, e.g. abandoned implantable cardioverter defibrillator (ICD) leads or pacemaker leads other than MRI conditional, lead extensions, other active medical devices, non-MRI compatible devices, mechanical valve

The above is a clinical trial exclusion criterion. Annotated with entity spans:
Have other [Device: medical implants] that may [Condition: interact with MRI], e.g. [Device: abandoned implantable cardioverter defibrillator (ICD) leads] or [Device: pacemaker leads] [Negation: other than] [Device: MRI conditional], [Device: lead extensions], [Qualifier: other] [Device: active medical devices], [Device: non-MRI compatible devices], [Device: mechanical valve]